下列何者較適合用於心臟移植手術後病患的運動訓練強度？
A. 無氧閾值
B. 最大心率的百分之八十五
C. 最大心率的百分之六十
D. （運動耐受測試時的最大心率－休息時心率）×（40 - 60）%＋休息時心率

正確答案：A. 無氧閾值